Clinical trial exclusion criterion:
Allergy to anesthetic agents

Annotated entities:
- Condition: "Allergy"
- Drug: "anesthetic agents"